某研究設計係在母親懷孕前一年即進行其吸菸量的蒐集工作，然後一直到嬰兒出生時，測量嬰兒出生體重以了解母親吸菸與嬰兒低出生體重的相關性，此一研究設計為：
A. 前瞻性世代追蹤研究（Prospective Cohort Study）
B. 回溯性世代追蹤研究（Retrospective Cohort Study）
C. 病例對照研究（Case-control Study）
D. 斷代研究（Cross-sectional Study）

正確答案：A. 前瞻性世代追蹤研究（Prospective Cohort Study）